Relativo a las topoisomerasas:
1. Son    enzimas      que    convierten     los D-aminoácidos en L-aminoácidos.
2. Son enzimas que sintetizan DNA.
3. Son enzimas que participan en la unión de las subunidades del ribosoma.
4. Son enzimas que desnaturalizan el DNA.
5. La DNA girasa es una toposiomerasa especial.

Respuesta correcta: 5. La DNA girasa es una toposiomerasa especial.